Clinical trial exclusion criterion:
Body Mass Index >29.9

Entity relations:
- Has_value("Body Mass Index", ">29.9")